下列關於癌症和它的腫瘤標記（tumor markers）之配對，何者錯誤？
A. carbohydrate antigen 19-9（CA19-9）and ovarian cancer
B. alpha fetoprotein（AFP）and hepatocellular carcinoma
C. carcinoembryonic antigen（CEA）and colon cancer
D. human chorionic gonadotropin（HCG）and choriocarcinoma

正確答案：A. carbohydrate antigen 19-9（CA19-9）and ovarian cancer